Clinical trial exclusion criterion:
Expected survival less than 1 year;

Entity relations:
- Has_value("Expected survival", "less than 1 year")